Unable to give informed consent in English

The above is a clinical trial exclusion criterion. Annotated with entity spans:
[Post-eligibility: Unable to give informed consent in English]